Clinical trial exclusion criterion:
Women that underwent local radiation or chemotherapy within the last 12 months

Annotated entities:
- Procedure: "local radiation"
- Procedure: "chemotherapy"
- Temporal: "within the last 12 months"
- Person: "Women"